Clinical trial exclusion criterion:
Concurrent administration of any other anti-tumor therapy

Annotated entities:
- Procedure: "anti-tumor therapy"
- Temporal: "Concurrent"
- Qualifier: "any other"